慣用右手之患者突然右半身體無法動彈（hemiplegia），且無法清楚說話，但能以左手手勢正確回應醫生提出之問題。經診斷為腦部血管阻塞性中風。下列何處損傷可以合理解釋該患者之症狀？
A. 左半腦含 Broca's area
B. 左半腦含 Wernicke's area
C. 右半腦含 Broca's area
D. 右半腦含 Wernicke's area

正確答案：A. 左半腦含 Broca's area